What is the synonym of MK-1602?

MK-1602 is also named Ubrogepant.